6. Each volunteer must have a valid social security number

The above is a clinical trial inclusion criterion. Annotated with entity spans:
[Parsing_Error: 6.] [Post-eligibility: Each volunteer must have a valid social security number]